Salzburg EEG criteria are used to diagnose which disorder?

Salzburg EEG criteria are used to diagnose Nonconvulsive Status Epilepticus.